Clinical trial exclusion criteria:
Patients with cardiac, pulmonary, hepatic, or renal dysfunction, epilepsy, or uncontrolled hypertension, or those taking medications that influence the central nervous system, are excluded from the study. Patients who show obvious alteration of mental status, or refuse to participate, are also excluded from the study.

Annotated entities:
- Condition: "renal dysfunction"
- Condition: "hepatic dysfunction"
- Condition: "pulmonary dysfunction"
- Condition: "cardiac dysfunction"
- Condition: "epilepsy"
- Qualifier: "uncontrolled"
- Condition: "hypertension"
- Drug: "medications that influence the central nervous system"
- Condition: "alteration of mental status"
- Observation: "refuse to participate"
- Informed_consent: "refuse to participate"